Clinical trial exclusion criterion:
Previous vaccination against meningococcal disease with either the study vaccine or another meningococcal vaccine

Entity relations:
- AND("vaccination against meningococcal disease", "study vaccine")
- AND("vaccination against meningococcal disease", "another meningococcal vaccine")